Clinical trial inclusion criterion:
Healthy male volunteers, 18 to 45 years of age, inclusive. Healthy status is defined by absence of evidence of any active or chronic disease following a detailed medical and surgical history, a complete physical examination including vital signs, 12-lead ECG, hematology, blood chemistry, serology and urinalysis

Annotated entities:
- Condition: "Healthy"
- Person: "male"
- Value: "18 to 45 years , inclusive"
- Person: "age"
- Negation: "absence"
- Observation: "evidence of any active or chronic disease"
- Temporal: "medical history"
- Temporal: "surgical history"
- Procedure: "physical examination"
- Procedure: "vital signs"
- Procedure: "12-lead ECG"
- Procedure: "hematology"
- Procedure: "blood chemistry"
- Procedure: "serology"
- Procedure: "urinalysis"